Clinical trial exclusion criterion:
Subjects with known upper extremity deep vein thromboses (subclavian or distal)

Entity relations:
- Has_qualifier("upper extremity deep vein thromboses", "subclavian")
- OR("subclavian", "distal")